Clinical trial inclusion criteria:
1. Women 18 to 40 years of age inclusive who can give written informed consent
2. Available for all visits and consent to follow all procedures scheduled for the study
3. Agree to daily application of gel and monitoring as per Daily Monitored Adherence (DMA) method
4. Healthy and self-reported sexually active
5. HIV-negative as determined by a HIV rapid test at time of enrollment
6. On a stable form of contraception and willing to continue on this stable method of contraception, OR, Have undergone surgical sterilisation at least 3 months prior to enrollment
7. In the absence of the use of exogenous hormone(s), have a self-reported regular menstrual cycle defined as having a minimum of 21 days and a maximum of 36 days between menses
8. Upon pelvic/speculum examination and colposcopy at the time of enrollment, the cervix and vagina appear normal as determined by the investigator
9. Asymptomatic for genital infections at the time of enrollment
10. Willing to refrain from use of vaginal products or objects within 14 days prior to enrollment and for the duration of the study
11. Willing to answer acceptability and adherence questionnaires throughout the study
12. Willing to refrain from participation in any other research study for the duration of this study
13. Willing to provide adequate locator information for study retention purposes and be reachable per local standard procedures

Annotated entities:
- Person: "Women"
- Value: "18 to 40 years"
- Person: "age"
- Observation: "can give written informed consent"
- Post-eligibility: "can give written informed consent"
- Post-eligibility: "Available for all visits and consent to follow all procedures scheduled for the study"
- Post-eligibility: "Agree to daily application of gel and monitoring as per Daily Monitored Adherence (DMA) method"
- Drug: "gel"
- Multiplier: "daily"
- Procedure: "monitoring"
- Condition: "Healthy"
- Condition: "sexually active"
- Observation: "self-reported"
- Qualifier: "self-reported"
- Condition: "HIV-negative"
- Measurement: "HIV"
- Value: "negative"
- Measurement: "HIV rapid test"
- Temporal: "at time of enrollment"
- Reference_point: "time of enrollment"
- Pregnancy_considerations: "On a stable form of contraception and willing to continue on this stable method of contraception, OR, Have undergone surgical sterilisation at least 3 months prior to enrollment"
- Drug: "exogenous hormone"
- Negation: "absence"
- Value: "regular"
- Measurement: "menstrual cycle"
- Condition: "regular menstrual cycle"
- Value: "minimum of 21 days"
- Value: "maximum of 36 days"
- Procedure: "speculum examination"
- Procedure: "pelvic examination"
- Procedure: "colposcopy"
- Temporal: "at the time of enrollment"
- Observation: "vagina"
- Observation: "cervix"
- Value: "normal"
- Qualifier: "normal"
- Subjective_judgement: "as determined by the investigator"
- Condition: "genital infections"
- Mood: "Asymptomatic"
- Temporal: "at the time of enrollment"
- Mood: "Willing"
- Drug: "vaginal products"
- Drug: "objects vaginal"
- Temporal: "within 14 days prior to enrollment"
- Temporal: "for the duration of the study"
- Reference_point: "enrollment"
- Reference_point: "the study"
- Negation: "refrain"
- Observation: "adherence questionnaires"
- Observation: "acceptability questionnaires"
- Temporal: "throughout the study"
- Mood: "Willing"
- Post-eligibility: "Willing to answer acceptability and adherence questionnaires throughout the study"
- Non-query-able: "Willing to answer acceptability and adherence questionnaires throughout the study"
- Post-eligibility: "Willing to refrain from participation in any other research study for the duration of this study"
- Non-query-able: "Willing to refrain from participation in any other research study for the duration of this study"
- Post-eligibility: "Willing to provide adequate locator information for study retention purposes and be reachable per local standard procedures"
- Non-query-able: "Willing to provide adequate locator information for study retention purposes and be reachable per local standard procedures"